Clinical trial exclusion criterion:
Active drug or alcohol use or dependence that, in the opinion of the site investigator, would interfere with adherence to study requirements.

Entity relations:
- Has_temporal("drug use or dependence", "Active")
- OR("drug use or dependence", "alcohol use or dependence")